What is the role of Gata3 in Th2 cells?

Gata3 coordinates the progression of H3K9me2/H3K27me3 by mediating histone deacetylation and chromatin remodeling in Th2 cells.  Gata3 plays an important role in this process by repressing the expression of histone H3 in Th1 cells and by promoting chromatin condensation during DNA damage-induced DNA damage.